Glaucoma, pheochromocytoma, or known or suspected hypersensitivity to methylphenidate or its excipients

The above is a clinical trial exclusion criterion. Annotated with entity spans:
[Condition: Glaucoma], [Condition: pheochromocytoma], or [Observation: known] or [Observation: suspected] [Condition: hypersensitivity] to [Drug: methylphenidate or its excipients]